Clinical trial exclusion criterion:
Follow-up less than 1 year

Entity relations:
- Has_temporal("Follow-up", "less than 1 year")